History of thromboembolic event (e.g., PE or DVT)

The above is a clinical trial exclusion criterion. Annotated with entity spans:
History of [Condition: thromboembolic event] (e.g., [Condition: PE] or [Condition: DVT])